Clinical trial exclusion criterion:
Significant hepatic disease

Annotated entities:
- Qualifier: "Significant"
- Condition: "hepatic disease"